Clinical trial exclusion criterion:
Hemoglobin < 10 g/l and/or leucocytes < 4000 cels/mm3 and/or platelets < 150.000 cels/mm3;

Annotated entities:
- Measurement: "Hemoglobin"
- Value: "< 10 g/l"
- Measurement: "leucocytes"
- Value: "< 4000 cels/mm3"
- Measurement: "platelets"
- Value: "< 150.000 cels/mm3"